Subjects who previously enrolled in this study

The above is a clinical trial exclusion criterion. Annotated with entity spans:
[Context_Error: Subjects who previously enrolled in this study]